Clinical trial exclusion criterion:
Carrier of prosthetic mesh in the ostomy

Entity relations:
- AND("ostomy", "prosthetic mesh")